Clinical trial exclusion criterion:
Use of medications associated with steatosis eg. Methotrexate, anticonvulsants, antiretroviral therapy etc.

Annotated entities:
- Drug: "medications"
- Condition: "steatosis"
- Drug: "Methotrexate"
- Drug: "anticonvulsants"
- Drug: "antiretroviral therapy"